Clinical trial inclusion criterion:
Absence of skin injures, infections or tumor in the target knee;

Annotated entities:
- Condition: "skin injures"
- Negation: "Absence"
- Condition: "infections"
- Condition: "tumor"
- Reference_point: "target knee"